Clinical trial inclusion criterion:
HCV genotype 4,

Entity relations:
- Has_value("HCV genotype", "4")